慢性骨盆腔疼痛的鑑別診斷中Mittelschmerz表示：
A. 痛經
B. 排卵痛
C. 發炎痛
D. 痔瘡痛

正確答案：B. 排卵痛